¿Qué porcentaje del bicarbonato filtrado en el glomérulo se reabsorbe en condiciones normales a lo largo de la nefrona y en qué segmento se produce la mayor parte de esta reabsorción?:
1. Se reabsorbe casi el 100%, en su mayor parte en el conducto colector.
2. Se reabsorbe aproximadamente el 50%, en su mayor parte en el túbulo contorneado proximal.
3. Se reabsorbe aproximadamente el 50%, en su mayor parte en el túbulo contorneado distal.
4. Se reabsorbe menos del 20%, en su mayor parte en el conducto colector.
5. Se reabsorbe casi el 100%, en su mayor parte en el túbulo contorneado proximal.

Respuesta correcta: 5. Se reabsorbe casi el 100%, en su mayor parte en el túbulo contorneado proximal.